Patient harboring a GRE or CRE bacteria

The above is a clinical trial inclusion criterion. Annotated with entity spans:
Patient harboring a [Condition: GRE] or [Condition: CRE bacteria]